Which enhancers are characterized as latent?

Here , we describe latent enhancers , defined as regions of the genome that in terminally differentiated cells are unbound by TFs and lack the histone marks characteristic of enhancers but acquire these features in response to stimulation .